El vector de la tularemia es un/a:
1. Coleóptero.
2. Piojo.
3. Pulga.
4. Garrapata.
5. Mosquito.

Respuesta correcta: 4. Garrapata.